Patient with Hepatitis B Virus (HBV), Hepatitis C Virus (HCV) and Human Immunodeficiency Virus (HIV) infections

The above is a clinical trial exclusion criterion. Annotated with entity spans:
Patient with [Condition: Hepatitis B Virus] ([Condition: HBV]), [Condition: Hepatitis C Virus] ([Condition: HCV]) and [Condition: Human Immunodeficiency Virus] ([Condition: HIV]) infections